Clinical trial exclusion criterion:
Erythropoiesis-stimulating agents (ESA) administered within 4 weeks prior to Screening

Annotated entities:
- Drug: "Erythropoiesis-stimulating agents"
- Drug: "ESA"
- Temporal: "within 4 weeks prior to Screening"
- Reference_point: "Screening"